Previous enrolment in this study or treatment with an investigational drug or device under another study protocol in the past 30 days.

The above is a clinical trial exclusion criterion. Annotated with entity spans:
[Temporal: Previous] [Observation: enrolment in this study] or [Procedure: treatment with an investigational drug] or [Device: device] under another study protocol in the past 30 days.